Taking Clopidogrel 75 mg daily dose for at least 7 days or taking Clopidogrel 75 mg daily dose for less than 7 days but with 300 to 600 mg Clopidogrel loading dose before PCI.

The above is a clinical trial inclusion criterion. Annotated with entity spans:
Taking [Drug: Clopidogrel] [Multiplier: 75 mg] [Multiplier: daily] dose [Temporal: for at least 7 days] or taking [Drug: Clopidogrel] [Multiplier: 75 mg] [Multiplier: daily] dose [Temporal: for less than 7 days] but with [Multiplier: 300 to 600 mg] [Drug: Clopidogrel] loading dose [Temporal: before PCI].